Usted está informando a P. T. de la caída del cabello que se producirá sobre la segunda o tercera semana de comienzo del tratamiento con quimioterapia. Le sugiere empezar a usar la peluca antes de la pérdida de pelo con el fin de:
1. Ocultar la alopecia.
2. Disminuir la despersonalización.
3. Brindar alternativas a la paciente.
4. Prepararse para la pérdida y facilitar el ajuste.
5. Facilitar la elección de la peluca de color y estilo semejante antes de la alopecia.

Respuesta correcta: 4. Prepararse para la pérdida y facilitar el ajuste.